Los fármacos de elección para el Trastorno de Ansiedad por Separación, son:
1. Los antidepresivos.
2. Los antihistamínicos.
3. Los beta-bloqueantes.
4. Los antipsicóticos.

Respuesta correcta: 1. Los antidepresivos.